Intracardiac mass, tumor, or thrombus

The above is a clinical trial exclusion criterion. Annotated with entity spans:
[Condition: Intracardiac mass], [Condition: tumor], or [Condition: thrombus]